Clinical trial exclusion criterion:
Under other medicine treatment which may affect heart rate, like Non-dihydropyridine calcium channel blockers (NDHP-CCBs) or ivabradine for the last 2 weeks; Under Digoxin treatment [more than (>) 0.125 milligram (mg)].

Entity relations:
- Subsumes("Non-dihydropyridine calcium channel blockers", "NDHP-CCBs")
- Subsumes("more than 0.125 milligram", "> 0.125 mg")
- Has_multiplier("Digoxin", "more than 0.125 milligram")
- Has_temporal("Non-dihydropyridine calcium channel blockers", "for the last 2 weeks")
- OR("Non-dihydropyridine calcium channel blockers", "ivabradine")